What is marked by DNaseI hypersensitive sites?

DNaseI hypersensitive sites correspond to regions along genomic regulatory regions where transcription starts and stops.